在一場醫院內肝炎防治演講中，有病患家屬提到共用碗筷是否會傳染病毒性肝炎，請問會經口傳染 （fecal-oral transmission）的病毒性肝炎有那幾項？
A. A 型肝炎或 B 型肝炎
B. B 型肝炎或 C 型肝炎
C. C 型肝炎或 E 型肝炎
D. A 型肝炎或 E 型肝炎

正確答案：D. A 型肝炎或 E 型肝炎